執行跑步機運動心電圖檢查（treadmill exercise test）時，何者不是停止檢查之時機？
A. 病人發生持續性心室頻脈（ventricular tachycardia）
B. 病人血壓較檢查前上升 30 mmHg
C. 病人血壓較檢查前下降超過 10 mmHg
D. 病人心電圖 ST 節段下降超過 0.2 mV

正確答案：B. 病人血壓較檢查前上升 30 mmHg